3. Clinically significant persistent immune-related adverse events following prior therapy.

The above is a clinical trial exclusion criterion. Annotated with entity spans:
[Parsing_Error: 3.] [Qualifier: Clinically significant] [Qualifier: persistent] [Condition: immune-related adverse events] [Temporal: following prior therapy].